Mujer de 20 años con tumoración ovárica de 15 cm, sólido-quística, detectada por ecografía tras presentar síntomas abdominales inespecíficos. En el estudio histopatológico de la pieza correspondiente se encuentran dientes, pelos, zonas de epitelio intestinal, áreas de epitelio escamoso (15%) y bronquial, así como elementos neuroectodérmicos y embrionarios en varias de las preparaciones histológicas. En referencia a este caso, señale el diagnóstico correcto:
1. Teratocarcinoma.
2. Teratoma inmaduro.
3. Teratoma quístico maduro.
4. Disgerminoma.

Respuesta correcta: 2. Teratoma inmaduro.